Clinical trial exclusion criterion:
A daily alcohol intake >2 units/day.

Entity relations:
- Has_multiplier("alcohol", ">2 units/day")